Clinical trial exclusion criterion:
Anemia (hematocrit < 27%)

Annotated entities:
- Condition: "Anemia"
- Measurement: "hematocrit"
- Value: "< 27%"